腦下垂體前葉機能喪失（Sheehan syndrome）的人，可以用下列何者來催排卵？
A. Low-dose estrogen therapy
B. Human menopausal gonadotropin（hMG）injections
C. Pulsatile GnRH
D. Clomiphene citrate

正確答案：B. Human menopausal gonadotropin（hMG）injections